Thrombolytic therapy within 24 hours before randomization

The above is a clinical trial exclusion criterion. Annotated with entity spans:
[Procedure: Thrombolytic therapy] [Temporal: within 24 hours before randomization]